Clinical trial exclusion criterion:
Female of childbearing potential planing/being pregnant or unwilling to use contraception.

Annotated entities:
- Pregnancy_considerations: "Female of childbearing potential planing/being pregnant or unwilling to use contraception."